Clinical trial inclusion criterion:
current or former smoker with an accumulated consumption >10 packs x year

Annotated entities:
- Person: "smoker"
- Observation: "consumption"
- Multiplier: ">10 packs x year"